Clinical trial exclusion criterion:
Other protocol defined exclusion criteria could apply

Annotated entities:
- Non-representable: "Other protocol defined exclusion criteria could apply"